Pelvic inflammatory disease.

The above is a clinical trial exclusion criterion. Annotated with entity spans:
[Condition: Pelvic inflammatory disease].